Clinical trial inclusion criterion:
Pregnant women with APS diagnosed according to the revised classification criteria for APS in 2006 in Sydney, Australia

Annotated entities:
- Condition: "Pregnant"
- Person: "women"
- Condition: "APS"
- Qualifier: "revised classification criteria for APS in 2006 in Sydney, Australia"